Clinical trial inclusion criteria:
Adult male and female aged 19 to 75 years
Voluntarily consented to participate in the study and signed the informed consent form after receiving the explanation of the objectives, methods and effects of the study.

Annotated entities:
- Person: "male"
- Person: "female"
- Person: "aged"
- Value: "19 to 75 years"
- Informed_consent: "Voluntarily consented to participate in the study and signed the informed consent form after receiving the explanation of the objectives, methods and effects of the study."